All patients admitted to the ICU in septic shock

The above is a clinical trial inclusion criterion. Annotated with entity spans:
All patients [Procedure: admitted] to the [Visit: ICU] in [Condition: septic shock]